一位40歲男性過去無任何病史，最近因為極度疲倦、嗜睡、食慾減少來就醫。病患回想這些症狀是在三個月 前一次嚴重頭痛後發生。檢查發現飯前血糖90 mg/dL，PR 70/min，BP 100/60 mmHg，free T4 0.5 ng/dL
 （normal range 0.8～1.8 ng/dL），TSH 1.0 µIU/mL（normal range 0.1～2.0 µIU/mL），early morning cortisol 2.0 µg/dL（normal range 9.0～15 µg/dL），體毛、鬍鬚減少。電腦斷層攝影發現蝶鞍（sella）部位有一3公分不均質腫塊，壓迫腦下垂體組織。最可能的診斷為何？
A. 泌乳激素瘤pituitary prolactinoma
B. 腦下垂體中風pituitary apoplexy
C. 顱咽管瘤craniopharyngioma
D. 空蝶鞍症候群empty sella syndrome

正確答案：B. 腦下垂體中風pituitary apoplexy